一位 56 歲的男性糖尿病患，有糖尿病足來到門診，與醫師討論有沒有可能憑藉換藥使傷口癒合，則下列何項最具決定性？
A. 抽血檢查 HbA1c
B. 安排神經傳導及肌電圖檢查（NCV/EMG）
C. 做細菌培養
D. 檢查足背動脈與後脛動脈有無脈動

正確答案：D. 檢查足背動脈與後脛動脈有無脈動